男性勃起功能的有效藥物 Sildenafil（商品名 Viagra）主要是第幾型 phosphodiesterase 的阻斷劑？
A. 第一型
B. 第三型
C. 第五型
D. 第六型

正確答案：C. 第五型